分泌副甲狀腺素的細胞是：
A. 副甲狀腺嗜酸性細胞
B. 副甲狀腺主細胞
C. 甲狀腺濾泡旁細胞
D. 甲狀腺濾泡上皮細胞

正確答案：B. 副甲狀腺主細胞